toxicity or intolerance if receiving a boosted-protease inhibitor regimen at screening (with plasma HIV RNA < 400 copies/mL at screening)

The above is a clinical trial inclusion criterion. Annotated with entity spans:
[Condition: toxicity] or [Condition: intolerance] if receiving a [Procedure: boosted-protease inhibitor regimen] [Temporal: at screening] (with [Measurement: plasma HIV RNA] [Value: < 400 copies/mL] [Temporal: at screening])